Clinical trial exclusion criterion:
Preoperative obstructive sleep apnea (previously diagnosed as obstructive sleep apnea, or a STOP-Bang score >= 3);

Annotated entities:
- Condition: "obstructive sleep apnea"
- Temporal: "Preoperative"
- Condition: "obstructive sleep apnea"
- Measurement: "STOP-Bang score"
- Value: ">= 3"